Clinical trial exclusion criterion:
Women with history of previous thromboembolic disorders

Annotated entities:
- Person: "Women"
- Temporal: "history"
- Temporal: "previous"
- Condition: "thromboembolic disorders"